Clinical trial exclusion criterion:
Planned hospitalization during the study period, for any diagnostic or treatment procedures.

Annotated entities:
- Mood: "Planned"
- Procedure: "hospitalization"
- Temporal: "during the study period"
- Procedure: "treatment procedures"
- Procedure: "diagnostic procedures"